Systemic or ocular medications that may confound the outcome of the intervention

The above is a clinical trial exclusion criterion. Annotated with entity spans:
[Drug: Systemic] or [Drug: ocular medications] that [Qualifier: may confound the outcome of the intervention]